Explain the association between Barr bodies (nuclear inclusions) and the X chromosome?

Transcriptional inactivation of one X chromosome in mammalian female somatic cells leads to condensation of the inactive X chromosome into the heterochromatic sex chromatin, or Barr body.